¿Cuál es la opción FALSA de entre las siguientes afirmaciones relacionadas con los canales iónicos dependientes de voltaje?:
1. Se abren cuando la membrana se despolariza.
2. Son la base del mecanismo de excitabilidad de la membrana.
3. Están conformados por varias unidades proteicas.
4. Están acoplado a proteínas fijadoras de nucleótidos de guanina.

Respuesta correcta: 4. Están acoplado a proteínas fijadoras de nucleótidos de guanina.